Which class of disorders are caused by AMPA receptor GluA2 subunit defects?

Mutations in the AMPA receptor GluA2 subunit cause a variety of neurodevelopmental disorders including autism spectrum disorder.